Child Pugh class B or C

The above is a clinical trial exclusion criterion. Annotated with entity spans:
[Measurement: Child Pugh class] [Value: B or C]